嚴重之 acetaminophen 肝中毒（hepatotoxicity）的最佳治療藥物為下列何者？
A. silibinin
B. 類皮質糖（glucocorticoid）
C. 乙醯半胱胺基酸（N-acetylcysteine）
D. 熊去氧膽酸（ursodeoxycholic acid）

正確答案：C. 乙醯半胱胺基酸（N-acetylcysteine）